Clinical trial inclusion criteria:
Endometrial thickness = 7 mm after stimulation
18-45 years
IVF/ICSI fertilisation
BMI > 18,5 <30 kg/m2
cycle length 25-34 days

Annotated entities:
- Measurement: "Endometrial thickness"
- Value: "= 7 mm"
- Temporal: "after stimulation"
- Procedure: "stimulation"
- Reference_point: "stimulation"
- Value: "18-45"
- Person: "years"
- Procedure: "IVF fertilisation"
- Procedure: "ICSI fertilisation"
- Measurement: "BMI"
- Value: "> 18,5 <30 kg/m2"
- Measurement: "cycle length"
- Value: "25-34 days"